下列何者是成人機械性腸阻塞（mechanical obstruction）最主要的成因？
A. 疝氣
B. 癌症
C. 手術後沾黏
D. 腸扭轉（malrotation）

正確答案：C. 手術後沾黏